Extracranial active bleeding

The above is a clinical trial exclusion criterion. Annotated with entity spans:
[Condition: Extracranial] [Qualifier: active] bleeding